Clinical trial inclusion criterion:
English or Spanish speaking

Entity relations:
- OR("English speaking", "Spanish speaking")